Clinical trial exclusion criterion:
Inability to give informed consent by patient or healthcare proxy

Annotated entities:
- Observation: "Inability to give informed consent"
- Informed_consent: "Inability to give informed consent by patient or healthcare proxy"